1. Patient with equivocal diagnosis of rupture of membranes

The above is a clinical trial exclusion criterion. Annotated with entity spans:
[Parsing_Error: 1.] Patient with [Negation: equivocal] diagnosis of [Condition: rupture of membranes]